(3)History of adverse reactions or intolerance to enalapril or other ACE inhibitors, or drugs or supplements containing folic acid;

The above is a clinical trial exclusion criterion. Annotated with entity spans:
(3)[Temporal: History] of [Condition: adverse reactions] or [Condition: intolerance] to [Drug: enalapril] or [Qualifier: other] [Drug: ACE inhibitors], or drugs or supplements containing [Drug: folic acid];